All cases were a 'full stomach' is suspected (gastric banding)

The above is a clinical trial exclusion criterion. Annotated with entity spans:
[Non-representable: All cases were a 'full stomach' is suspected (gastric banding)]